Dysregulated thyroid diseases, use of antithyroid treatment.

The above is a clinical trial exclusion criterion. Annotated with entity spans:
[Qualifier: Dysregulated] [Condition: thyroid diseases], use of [Procedure: antithyroid treatment].